Clinical trial exclusion criterion:
tricyclic antidepressants

Annotated entities:
- Drug: "tricyclic antidepressants"